Mujer de 27 años remitida a consulta de ginecología para su valoración refiriendo dispareunia desde hace unos 8 meses, junto con disquecia y rectorragia ocasional coincidiendo con la menstruación desde hace 3-4 meses. También refiere dismenorrea desde hace años que controla bien con Ibuprofeno. Lleva intentando quedarse embarazada unos 16 meses sin haberlo conseguido aún. En la exploración ginecológica tan solo se aprecia dolor al presionar fondo de saco vaginal posterior. ¿Qué prueba considera usted que le permitiría llegar al diagnóstico de certeza de su patología?
1. Ecografía transvaginal.
2. Laparoscopia diagnóstica.
3. Resonancia magnética.
4. Colonoscopia.

Respuesta correcta: 2. Laparoscopia diagnóstica.